骨質疏鬆長期易導致骨折，造成病人長期之臥床。適當之治療在飲食、運動、足夠鈣之攝食外，下列何者並非對男性患者最適當治療方式？
A. Parathyroid hormone
B. Bisphosphonates
C. Calcitonin
D. Testosterone

正確答案：D. Testosterone